38 歲女性因不孕 5 年，接受腹腔鏡手術，手術診斷為中度子宮內膜異位症（stageⅢ），經手術 處理後，何者為最佳處置？
A. danazol
B. cyclic oral contraceptive pills
C. GnRH agonist
D. 積極懷孕

正確答案：D. 積極懷孕